Clinical trial inclusion criterion:
1. Patients with stable (Canadian Cardiovascular Society 1, 2, 3 or 4) or unstable (Braunwald class IB, IC, IIB, IIC, IIIB, IIIC) angina pectoris and ischemia, or patients with atypical chest pain or even those who are asymptomatic provided they have documented myocardial ischaemia (e.g. treadmill exercise test, radionuclide scintigraphy, stress echocardiography, Holter tape);

Annotated entities:
- Measurement: "Canadian Cardiovascular Society"
- Value: "1, 2, 3 or 4"
- Qualifier: "stable"
- Qualifier: "unstable"
- Measurement: "Braunwald class"
- Value: "IB"
- Condition: "angina pectoris"
- Condition: "ischemia"
- Condition: "atypical chest pain"
- Condition: "asymptomatic"
- Condition: "myocardial ischaemia"
- Observation: "documented"
- Procedure: "treadmill exercise test"
- Procedure: "radionuclide scintigraphy"
- Procedure: "stress echocardiography"
- Procedure: "Holter tape"
- Value: "IC"
- Value: "IIB"
- Value: "IIC"
- Value: "IIIB"
- Value: "IIIC"